Clinical trial exclusion criterion:
The participant has a history of clinically significant hypertension or other reactions associated with ingestion of tyramine-rich food.

Annotated entities:
- Condition: "hypertension"
- Qualifier: "clinically significant"
- Subjective_judgement: "clinically significant"
- Condition: "reactions associated with ingestion of tyramine-rich food"
- Undefined_semantics: "reactions associated with ingestion of tyramine-rich food"